Clinical trial exclusion criterion:
Lactose intolerance

Annotated entities:
- Condition: "intolerance"
- Drug: "Lactose"
- Condition: "Lactose intolerance"